Evidence of decompensated liver disease

The above is a clinical trial exclusion criterion. Annotated with entity spans:
Evidence of [Qualifier: decompensated] [Condition: liver disease]